Dementia: Diagnosis of dementia by DSM-IV;

The above is a clinical trial exclusion criterion. Annotated with entity spans:
[Condition: Dementia]: Diagnosis of dementia by [Qualifier: DSM-IV];